Clinical trial inclusion criterion:
7. Maternal and fetal condition remain stable after hospitalization for 72 hours

Annotated entities:
- Parsing_Error: "7."
- Condition: "fetal condition"
- Condition: "Maternal condition"
- Qualifier: "stable"
- Temporal: "after hospitalization for 72 hours"
- Reference_point: "hospitalization"